Clinical trial inclusion criterion:
Subjects have no history of the following: ongoing acute or intermittent pain, postoperative pain, respiratory compromise, acute or severe asthma, or constipation (less than 1 bowel movement every 2 days)

Entity relations:
- Has_qualifier("pain", "acute")
- Has_qualifier("pain", "postoperative")
- Has_qualifier("asthma", "acute")
- Has_negation("pain", "no")
- Has_negation("pain", "no")
- Has_negation("respiratory compromise", "no")
- Has_negation("asthma", "no")
- Has_negation("constipation", "no")
- OR("acute", "severe")
- OR("acute", "intermittent")